下列有關 postcentral gyrus 之敘述，何者正確？
A. 是重要的 motor cortex，負責發出運動命令啟動骨骼肌收縮
B. 與人格特質有密切關係
C. 受損時，其對應之體表位置之痛覺不會完全喪失
D. 負責長期記憶之形成

正確答案：C. 受損時，其對應之體表位置之痛覺不會完全喪失